Clinical trial inclusion criterion:
Received BCR and/or BCL2 inhibitors were intolerant or had relapsed/refractory disease afterwards.

Entity relations:
- AND("intolerant", "BCR inhibitors")
- Has_temporal("relapsed", "afterwards")
- OR("BCR inhibitors", "BCL2 inhibitors")
- OR("relapsed", "refractory disease")
- OR("intolerant", "relapsed")